Body Mass Index > 40;

The above is a clinical trial exclusion criterion. Annotated with entity spans:
[Measurement: Body Mass Index] [Value: > 40];